Clinical trial inclusion criterion:
normal full term single pregnancy

Annotated entities:
- Condition: "pregnancy"
- Multiplier: "single"
- Qualifier: "normal"
- Qualifier: "full term"